Clinical trial inclusion criteria:
Newly dignosised type 2 diabetes according to WHO criteria.glycated hemoglobin (HbA1c) was more than 10%;
Seronegative for antibodies against insulin, islet cells and glutamic acid decarboxylase (GAD);

Annotated entities:
- Temporal: "Newly dignosised"
- Condition: "type 2 diabetes"
- Qualifier: "WHO criteria"
- Measurement: "glycated hemoglobin (HbA1c)"
- Value: "more than 10%"
- Negation: "Seronegative"
- Condition: "antibodies"
- Qualifier: "insulin"
- Qualifier: "islet cells"
- Qualifier: "glutamic acid decarboxylase (GAD)"